Clinical trial inclusion criteria:
Aged 25-80 at screening. Subjects older than 80 will be allowed at the discretion of the PI.
Ambulatory (defined as able to ambulate at least 10 meters, with or without assistance).
Clinical Diagnosis of PD based on the United Kingdom Brain Bank diagnostic criteria for PD.
At least 8 micturitions per 24 hours and
At least 3 urgency episodes per 3-day diary.
A MoCA score between 19 and 28 (inclusive) at screening. For those on cognitive enhancers (donepezil, rivastigmine, memantine, galantamine) a MoCA score between 19 and 29 (inclusive) at screening.
Provide informed consent to participate in the study and understand that they may withdraw their consent at any time without prejudice to their future medical care.
Be cognitively capable, in the opinion of investigator, to understand and provide such informed consent.
Be cognitively capable to complete the required questionnaires and assessments, OR have a care partner who is willing and capable to assist them in the completion of these tasks.
Be on a stable regimen of antiparkinson's medications at least 30 days prior to screening, and be expected to remain on a stable dose for the duration of the study.
If taking cognitive enhancers (donepezil, rivastigmine, memantine, galantamine), must be on stable dose at least 30 days prior to screening, and be expected to remain on a stable dose for the duration of the study.

Annotated entities:
- Person: "Aged"
- Value: "25-80"
- Non-query-able: "Subjects older than 80 will be allowed at the discretion of the PI"
- Person: "Ambulatory"
- Non-query-able: "defined as able to ambulate at least 10 meters, with or without assistance"
- Condition: "PD"
- Measurement: "United Kingdom Brain Bank diagnostic criteria"
- Condition: "micturitions"
- Multiplier: "At least 8 per 24 hours"
- Condition: "urgency episodes"
- Multiplier: "At least 3 per 3-day diary."
- Measurement: "MoCA score"
- Value: "between 19 and 28"
- Procedure: "cognitive enhancers"
- Drug: "donepezil"
- Drug: "rivastigmine"
- Drug: "memantine"
- Drug: "galantamine"
- Measurement: "MoCA score"
- Value: "between 19 and 29"
- Informed_consent: "Provide informed consent to participate in the study and understand that they may withdraw their consent at any time without prejudice to their future medical care"
- Informed_consent: "Be cognitively capable, in the opinion of investigator, to understand and provide such informed consent"
- Post-eligibility: "Be cognitively capable to complete the required questionnaires and assessments, OR have a care partner who is willing and capable to assist them in the completion of these tasks"
- Drug: "antiparkinson's medications"
- Temporal: "at least 30 days prior to screening"
- Reference_point: "screening"
- Procedure: "cognitive enhancers"
- Drug: "donepezil"
- Drug: "rivastigmine"
- Drug: "memantine"
- Drug: "galantamine"
- Qualifier: "stable dose"
- Temporal: "at least 30 days prior to screening"
- Reference_point: "screening"